Clinical trial inclusion criterion:
Must have a life expectancy of greater than three (3) months

Annotated entities:
- Observation: "life expectancy"
- Value: "greater than three (3) months"